Clinical trial inclusion criterion:
Adult patients (age = 18)

Annotated entities:
- Person: "Adult"
- Person: "age"
- Value: "= 18"